一位36歲女性，因近來常覺頭痛，測其血壓為180/110 mmHg，但身體其他部位並未發現明顯異常現象，腹部電腦斷層掃描發現她右側腎上腺有一個2 cm的腫瘤，而血液中發現K+異常的低。下列何者在其血液中的濃度最可能偏高？
A. ACTH
B. aldosterone
C. renin
D. catecholamine

正確答案：B. aldosterone